What is the role of tankyrases in response to Double Strand Breaks (DSBs)?

Tankyrases promote homologous recombination and check point activation in response to DSBs.